Prior cardiac surgery

The above is a clinical trial exclusion criterion. Annotated with entity spans:
[Temporal: Prior] [Procedure: cardiac surgery]